對於醫療法施行細則有關人體試驗之書面同意書內容，應載明事項中，下列何者不正確？
A. 可能產生之副作用及危險
B. 其他可能之治療方式及說明
C. 預期試驗效果
D. 接受試驗者未經計畫主持人同意，不得隨時撤回同意

正確答案：D. 接受試驗者未經計畫主持人同意，不得隨時撤回同意